有一位35歲運動員於健檢中，發現右腎邊緣區域有一個3.5公分的凸出實質腫瘤（不含脂肪），下列何種處置較適當？
A. 施行radical nephrectomy
B. 施行細針穿刺切片進行診斷
C. 施行partial nephrectomy
D. 使用口服標靶藥物治療

正確答案：C. 施行partial nephrectomy